The subject is willing and able to understand, sign and date the study specific patient informed consent and HIPAA authorization to volunteer participation in the study

The above is a clinical trial inclusion criterion. Annotated with entity spans:
[Post-eligibility: The subject is willing and able to understand, sign and date the study specific patient informed consent and HIPAA authorization to volunteer participation in the study]